下列有關人類退化性關節炎（osteoarthritis）的敘述，何者錯誤？
A. 男女之好發關節位置不同
B. 常發生的關節為髖關節、膝關節等
C. 不會出現發炎（inflammation）現象
D. 最常見的危險因子（risk factor）為年齡

正確答案：C. 不會出現發炎（inflammation）現象